有關大腸癌的敘述，何者正確？
A. 糞便潛血反應檢查敏感度較大腸鏡差，故不適合做大腸癌篩檢
B. 左側大腸癌較右側大腸癌容易有貧血的表現
C. 常規服用aspirin可減少腺瘤和腺癌的發生
D. 第三期的大腸癌患者手術後不必接受化學治療

正確答案：C. 常規服用aspirin可減少腺瘤和腺癌的發生